Clinical trial exclusion criterion:
Any condition requiring antibiotics 14 days prior to arriving for surgery.

Annotated entities:
- Procedure: "antibiotics"
- Temporal: "14 days prior to arriving for surgery"
- Reference_point: "arriving for surgery"
- Procedure: "surgery"